Clinical trial exclusion criterion:
History of diabetic ketoacidosis, pancreas or beta-cell transplantation, or diabetes secondary to pancreatitis or pancreatectomy; acute or chronic infective diseases, cancer or chemotherapy, history of pulmonary, renal or liver diseases, and drug abuse

Entity relations:
- AND("secondary to", "pancreatitis")
- Has_qualifier("diabetes", "secondary to")
- Has_qualifier("infective diseases", "acute")
- Has_temporal("diabetic ketoacidosis", "History")
- OR("pancreatitis", "pancreatectomy")
- OR("diabetic ketoacidosis", "chemotherapy", "drug abuse", "renal diseases", "pulmonary diseases", "liver diseases", "infective diseases", "diabetes", "pancreas transplantation", "beta-cell transplantation", "cancer")
- OR("acute", "chronic")